40 歲林先生，經診斷罹患慢性思覺失調症（原名精神分裂症）。某日林先生於大街上持掃帚胡亂揮舞，幸未造成他人傷害，被警察及家屬送至醫院急診，急診的住院醫師診視發現林先生有明顯之被害妄想、被控制妄想及聽幻覺，但林先生拒絕接受住院治療，下列敘述何者正確？
A. 住院醫師診斷確定之後，應立即將林先生強制住院
B. 林先生之行為觸犯法律，應請警察將林先生移送法辦
C. 林先生直接接受門診追蹤即可
D. 住院醫師應請精神科專科醫師評估林先生之狀況

正確答案：D. 住院醫師應請精神科專科醫師評估林先生之狀況